Clinical trial exclusion criterion:
Subjects who are already on treatment with TAC, cyclosporine or any other calcineurin inhibitor for over 4 weeks within the past 12 months.

Entity relations:
- Has_multiplier("TAC", "over 4 weeks")
- Has_temporal("TAC", "past 12 months.")
- OR("TAC", "cyclosporine", "calcineurin inhibitor")